甲狀腺手術時，如果需要橫斷胸甲狀肌（sternothyroid m.）及胸舌骨肌（sternohyoid m.）時，最好打斷的位置在較高位接近環狀軟骨水平（cricoid level）位置，以保留何種運動神經？
A. 上喉神經（superior laryngeal nerve）
B. 返喉神經（recurrent laryngeal nerve）
C. 舌下神經襻（ansa hypoglossi）
D. 脊髓神經（spinal nerve）

正確答案：C. 舌下神經襻（ansa hypoglossi）